Clinical trial inclusion criterion:
2. Males and females age ≥60 years in first relapse or refractory.

Annotated entities:
- Person: "Males"
- Person: "females"
- Person: "age"
- Value: "≥60 years"
- Multiplier: "first"
- Condition: "relapse"
- Condition: "refractory"